Clinical trial exclusion criteria:
Personal history of breast cancer
A terminal illness
Patients who are unable to give informed consent
Breast implants

Annotated entities:
- Condition: "breast cancer"
- Temporal: "Personal history"
- Condition: "terminal illness"
- Observation: "unable to give informed consent"
- Device: "Breast implants"